Clinical trial exclusion criterion:
Are using hormonal contraceptives, but are not on a stable dose of the same hormonal contraceptive product for at least 4 weeks before dosing and who do not agree to use the same contraceptive during the study and for 28 days after study drug discontinuation (Note: All female participants will be considered to be of childbearing potential unless they have been sterilized surgically [ie, bilateral tubal ligation, total hysterectomy, or bilateral oophorectomy, all with surgery at least 1 month before dosing]).

Entity relations:
- Has_temporal("hormonal contraceptive", "for at least 4 weeks before dosing")
- Has_qualifier("hormonal contraceptive", "stable dose")
- Has_negation("stable dose", "not")
- Has_index("for 28 days after study drug discontinuation", "study drug discontinuation")
- Has_qualifier("hormonal contraceptive", "the same")
- Has_qualifier("contraceptive", "the same")
- Has_temporal("contraceptive", "during the study")
- Has_temporal("contraceptive", "for 28 days after study drug discontinuation")
- Has_context("contraceptive", "do not agree")